Clinical trial exclusion criterion:
Left ventricular ejection fraction <40%.

Entity relations:
- Has_value("Left ventricular ejection fraction", "<40%")